Clinical trial inclusion criterion:
Patients of child-bearing potential should be using adequate contraceptive measures should not be breast feeding and must have a negative pregnancy test prior to start of dosing

Entity relations:
- Has_index("prior to start of dosing", "start of dosing")
- Has_temporal("pregnancy test", "prior to start of dosing")
- Has_value("pregnancy test", "negative")
- Has_negation("breast feeding", "not be")
- AND("child-bearing potential", "adequate contraceptive measures")
- AND("child-bearing potential", "breast feeding")
- AND("child-bearing potential", "pregnancy test")